antiemetic neuroleptics

The above is a clinical trial exclusion criterion. Annotated with entity spans:
[Drug: antiemetic neuroleptics]